Clinical trial inclusion criterion:
7. Have a ventilation-perfusion scan that rules out thromboembolic disease.

Entity relations:
- Has_negation("thromboembolic disease", "rules out")
- AND("thromboembolic disease", "ventilation-perfusion scan")